Second or third degree heart block without a pacemaker

The above is a clinical trial exclusion criterion. Annotated with entity spans:
[Condition: Second] or [Condition: third degree heart block] [Negation: without] a [Device: pacemaker]